Clinical trial exclusion criterion:
History of noncompliance to medical regimens or unwillingness to comply with the study protocol

Annotated entities:
- Temporal: "History of"
- Observation: "noncompliance to medical regimens"
- Mood: "unwillingness to"
- Informed_consent: "comply with the study protocol"